Clinical trial inclusion criterion:
Must have good compliance with medications Patients with asthma and COPD.

Annotated entities:
- Condition: "good compliance"
- Drug: "medications"
- Condition: "asthma"
- Condition: "COPD"